Clinical trial exclusion criterion:
autoimmune diseases,

Annotated entities:
- Condition: "autoimmune diseases"